Which brain structures have been investigated as potential targets for deep brain stimulation of patients suffering from major depression?

Subgenual cingulate gyrus, the anterior limb of the capsula interna, nucleus accumbens, medial forebrain bundle, habenula, and caudate nucleus have been investigated as potential targeted for the deep brain stimulation of patients suffering from major depression.